ALT or AST >= 1.5 x ULN

The above is a clinical trial exclusion criterion. Annotated with entity spans:
[Measurement: ALT] or [Measurement: AST] [Value: >= 1.5 x ULN]